Clinical trial exclusion criterion:
The presence of acute infectious and/or communicable illnesses within 1 month prior to study;

Annotated entities:
- Qualifier: "acute"
- Condition: "infectious illnesses"
- Condition: "communicable illnesses"
- Temporal: "within 1 month prior to study"
- Reference_point: "study"